Clinical trial exclusion criterion:
Pneumothorax in the two weeks prior to Visit 2

Entity relations:
- Has_index("in the two weeks prior to Visit 2", "Visit 2")